Clinical trial exclusion criterion:
acute cholecystitis within two months

Entity relations:
- Has_temporal("acute cholecystitis", "within two months")